La “hipótesis permisiva de la depresión” hace referencia a:
1. Factores educacionales.
2. Factores socioculturales.
3. Relaciones de pareja.
4. Déficits funcionales en serotonina y catecolaminas.

Respuesta correcta: 4. Déficits funcionales en serotonina y catecolaminas.